ASA physical state >II

The above is a clinical trial exclusion criterion. Annotated with entity spans:
[Measurement: ASA physical state] [Value: >II]